Clinical trial inclusion criterion:
Classification of the American Society of Anesthesiologists (ASA I-III)

Entity relations:
- Has_value("ASA", "I-III")
- Subsumes("Classification of the American Society of Anesthesiologists", "ASA")